Rest pain or tissue loss due to PAD (Fontaine stage III and IV),

The above is a clinical trial exclusion criterion. Annotated with entity spans:
[Condition: Rest pain] or [Condition: tissue loss] due to [Condition: PAD] ([Measurement: Fontaine stage] [Value: III] and [Value: IV]),